Person is under 18 years of age.

The above is a clinical trial exclusion criterion. Annotated with entity spans:
Person is [Value: under 18 years] of [Person: age].